有關 Clara 細胞，下列何項敘述錯誤？
A. 屬不具纖毛之單層立方細胞（simple cuboidal epithelium）
B. 可以分泌類似肺泡表面作用劑（surfactant-like material）
C. 具有氣體的交換功能
D. 分布於終端小支氣管（terminal bronchioles）內

正確答案：C. 具有氣體的交換功能